Clinical trial exclusion criterion:
Diagnosis of brainstem glioma

Annotated entities:
- Condition: "brainstem glioma"